某病人之組織檢體培養在攝氏25度，觀察到具有約3～6 µm大小之桶狀關節孢子（barrel-shaped arthroconidia）。最可能罹患下列那種疾病？
A. 芽生黴菌症（Blastomycosis）
B. 球黴菌症（Coccidioidomycosis）
C. 莢膜組織胞漿菌症（Histoplasmosis capsulati）
D. 副球黴菌症（Paracoccidioidomycosis）

正確答案：B. 球黴菌症（Coccidioidomycosis）